病童在遊戲時，因發紺及喘，遊戲必須中斷，並保持蹲站的姿勢一陣子，情形才改善，則其機轉為何？
A. 蹲站時可以增加周圍血管阻力，使右至左之分流量減少
B. 蹲站時，下肢肌肉收縮，可以減少靜脈回流，減少心衰竭
C. 蹲站時，頭部較低，血液容易流到頭部
D. 蹲站時，比較可以增加肺活量

正確答案：A. 蹲站時可以增加周圍血管阻力，使右至左之分流量減少